Which library is used for fixed-length approximate string matching?

libFLASM is a free open-source C++ software library for solving fixed-length approximate string matching under both the edit and the Hamming distance models.